Shielding of any part of the esophagus during radiotherapy (including posterior spinal cord shielding)

The above is a clinical trial exclusion criterion. Annotated with entity spans:
[Procedure: Shielding] of [Multiplier: any part of] the [Qualifier: esophagus] during [Procedure: radiotherapy] (including [Procedure: posterior spinal cord shielding])